一位 24 歲男性，最近幾個月來常有間歇性腹痛、發燒及輕微腹瀉，壓力大時更容易發作。身體檢查發現有直腸旁　管存在。大腸鏡檢查可見有些區域的黏膜有水腫、潰瘍變化，有些則正常。在病變區域切片檢查，顯微鏡下可見有潰瘍、急性與慢性發炎細胞浸潤，及非乾酪性肉芽腫（noncaseating granulomas）的變化。下列何者是最可能的診斷？
A. 阿米巴蟲病（Amebiasis）
B. 克隆氏病（Crohn disease）
C. 偽膜性結腸炎（Pseudomembranous colitis）
D. 潰瘍性結腸炎（Ulcerative colitis）

正確答案：B. 克隆氏病（Crohn disease）